有關前列腺癌的敘述，下列何者錯誤？
A. 結節性增生（nodular hyperplasia）是常見的癌前病變
B. 大多數為腺癌（adenocarcinoma）
C. 好發的位置是周邊區（peripheral zone）
D. 其骨轉移常是成骨性（osteoblastic）

正確答案：A. 結節性增生（nodular hyperplasia）是常見的癌前病變